Clinical trial exclusion criterion:
Subject declines participation

Annotated entities:
- Informed_consent: "Subject declines participation"